Serious tear film dysfunction syndrome TBUT < 5 s Schirmer: < 4 mm OSDI > 30 pints Corneal staining > grade III on the Oxford scale

The above is a clinical trial exclusion criterion. Annotated with entity spans:
[Condition: Serious tear film dysfunction syndrome] [Line: TBUT < 5 s] [Line: Schirmer: < 4 mm] [Line: OSDI > 30 pints] [Line: Corneal staining > grade III on the Oxford scale]